Participation in other drug clinical trial within the last 4 weeks;

The above is a clinical trial exclusion criterion. Annotated with entity spans:
[Competing_trial: Participation in other drug clinical trial within the last 4 weeks;]